Which clotting factor is inhibited by betrixaban?

Betrixaban is an orally administered direct clotting factor Xa inhibitor.